Clinical trial inclusion criterion:
Smokers, non-smokers or former-smokers

Annotated entities:
- Condition: "Smokers"
- Condition: "non-smokers"
- Condition: "former-smokers"